Clinical trial inclusion criterion:
therapy with aspirin and insulin;

Entity relations:
- OR("aspirin", "insulin")